Women aged 20-49;

The above is a clinical trial inclusion criterion. Annotated with entity spans:
[Person: Women] [Person: aged] [Value: 20-49];